下列有關喉返神經（recurrent laryngeal nerve）受傷會造成之症狀，何者錯誤？
A. 聲音沙啞
B. 噎住（choking）
C. 聲帶麻痺，處在中線旁（paramedian）位置或外展（abducted）位置
D. 咽喉上聲門（supraglottic larynx）感覺麻痺

正確答案：D. 咽喉上聲門（supraglottic larynx）感覺麻痺